Major depressive disorder in the last year requiring treatment

The above is a clinical trial exclusion criterion. Annotated with entity spans:
[Condition: Major depressive disorder] in the [Temporal: last year] requiring [Procedure: treatment]